age > 18

The above is a clinical trial inclusion criterion. Annotated with entity spans:
[Person: age] [Value: > 18]